First or second single kidney (cadaveric or living donors) transplant recipients.

The above is a clinical trial inclusion criterion. Annotated with entity spans:
[Procedure: First] or second single kidney ([Qualifier: cadaveric] or [Qualifier: living donors]) [Procedure: transplant] recipients.